No concurrent use of other investigational drugs or antineoplastic therapies.

The above is a clinical trial exclusion criterion. Annotated with entity spans:
[Negation: No] concurrent use of [Drug: other investigational drugs] or [Procedure: antineoplastic therapies].